La terminación de la traducción:
1. Tiene lugar en codones AUG.
2. Se produce por incorporación de una ARNt vacío.
3. Tiene lugar cuando el ribosoma alcanza el final del ARNm.
4. No consume energía.
5. Está mediada por proteínas con estructura parecida al ARNt.

Respuesta correcta: 5. Está mediada por proteínas con estructura parecida al ARNt.